Clinical trial exclusion criterion:
20. Significant/chronic renal insufficiency.

Annotated entities:
- Parsing_Error: "20."
- Condition: "chronic renal insufficiency"
- Qualifier: "Significant"
- Subjective_judgement: "Significant"